Which cyclin- dependent kinase inhibitor is regulated by Bmi-1?

p16INK4 (also known as CDKN2A)